Clinical trial exclusion criterion:
history of systemic or ocular thromboembolic events.

Annotated entities:
- Condition: "thromboembolic events"
- Qualifier: "ocular"
- Qualifier: "systemic"